一位 20 歲男性，被室友發現意識不清，送急診室時血壓 196/108 mmHg，心跳 125/分鐘，呼吸 23/分鐘，體溫 39℃，昏迷指數 GCS（Glasgow Coma Scale）＝E2V2M5，兩眼瞳孔直徑 5 mm 等大，皆有光反應，全身冒汗。此病人的臨床表現與下列何種中毒的典型表現最相近？
A. 抗組織胺（anti-histamine）
B. 海洛英（heroin）
C. 安非他命（amphetamine）
D. 有機磷（organophosphate）

正確答案：C. 安非他命（amphetamine）